Clinical trial exclusion criterion:
Severe claustrophobia

Annotated entities:
- Qualifier: "Severe"
- Condition: "claustrophobia"